下列關於抗精神病藥物的敘述，何者錯誤？
A. Clozapine 可用以治療其他抗精神病藥療效不佳的患者
B. Aripiprazole 為多巴胺的部分作用劑（dopamine partial agonist）
C. Risperidone 比起 clozapine 更易引起癲癇
D. 第二代抗精神病藥比傳統抗精神病藥較易引起代謝症候群（metabolic syndrome）

正確答案：C. Risperidone 比起 clozapine 更易引起癲癇